Clinical trial exclusion criterion:
1. The patient is pregnant or breastfeeding.

Annotated entities:
- Condition: "pregnant"
- Observation: "breastfeeding"